Hormonal treatment involving estrogen or progesterone 3 months prior to or during the study period, with the exception of medroxyprogesterone acetate for withdrawal bleeding.

The above is a clinical trial exclusion criterion. Annotated with entity spans:
Hormonal treatment involving [Drug: estrogen] or [Drug: progesterone] [Temporal: 3 months prior to] or [Temporal: during the study period], with the [Negation: exception] of [Drug: medroxyprogesterone acetate] for [Condition: withdrawal bleeding].